Clinical trial exclusion criterion:
Subject has been diagnosed with rheumatoid arthritis or other autoimmune disease.

Entity relations:
- Has_qualifier("autoimmune disease", "other")
- OR("rheumatoid arthritis", "autoimmune disease")